El surfactante pulmonar:
1. Lo secretan los neumocitos tipo I.
2. Estabiliza los alveolos.
3. Su principal componente es la albúmina.
4. Aumenta la tensión superficial del alveolo.
5. Sólo está en los alveolos pequeños.

Respuesta correcta: 2. Estabiliza los alveolos.